Clinical trial inclusion criterion:
Lobar and sublobar resections

Annotated entities:
- Procedure: "sublobar resections"
- Procedure: "Lobar resections"